Clinical trial inclusion criterion:
Patients must have a pre-treatment granulocyte count (i.e., segmented neutrophils + bands) of greater than or equal to 1,500/mm3, a hemoglobin level of greater than or equal to 9 gm/dl, and platelet count greater than or equal to 50,000/mm3. The granulocyte requirement may be waived if in the investigator's opinion the lower count reflects hypersplenism with adequate bone marrow reserves.

Entity relations:
- Subsumes("granulocyte count", "segmented neutrophils + bands")
- Has_value("platelet count", "greater than or equal to 50,000/mm3")
- Has_value("hemoglobin level", "greater than or equal to 9 gm/dl")
- Has_value("granulocyte count", "greater than or equal to 1,500/mm3")
- Has_temporal("granulocyte count", "pre-treatment")
- Has_temporal("hemoglobin level", "pre-treatment")
- Has_temporal("platelet count", "pre-treatment")